人可當下列何種寄生蟲之終宿主及中間宿主？
A. 曼森裂頭絛蟲（Spirometra mansonoides）
B. 顆粒性包生絛蟲（Echinococcus granulosus）
C. 有鈎絛蟲（Taenia solium）
D. 犬複殖器絛蟲（Dipylidium caninum）

正確答案：C. 有鈎絛蟲（Taenia solium）